List variants of the MC1R gene.

V60L
D84E
V92M
R151C
R160W
R163Q
D294H